Acute symptomatic BV

The above is a clinical trial inclusion criterion. Annotated with entity spans:
[Temporal: Acute] [Qualifier: symptomatic] [Condition: BV]